戒菸的人可能出現下列何種尼古丁戒斷症狀？
A. 心搏速降低
B. 體重減輕
C. 降低肌肉張力
D. 血壓升高

正確答案：A. 心搏速降低